捏擠龜頭誘發肛門括約肌收縮的反射是經由下列何神經所傳導？
A. 腹下神經（hypogastric nerve）
B. 骨盆神經（pelvic nerve）
C. 內臟薦神經（sacral splanchnic nerve）
D. 會陰神經（pudendal nerve）

正確答案：D. 會陰神經（pudendal nerve）